Clinical trial exclusion criterion:
Patients with current scalp infection.

Entity relations:
- Has_temporal("scalp infection", "current")